Clinical trial exclusion criterion:
Surgically altered biliary tract anatomy, not including prior cholecystectomy

Annotated entities:
- Condition: "Surgically altered biliary tract anatomy"
- Procedure: "cholecystectomy"
- Temporal: "prior"
- Negation: "not"